Explain the action of Balovaptan.

Balovaptan is an orally administered selective vasopressin V1a receptor antagonis. Balovaptan has been evaluated for improvement of social communication and interaction.